Clinical trial exclusion criterion:
Known allergies to midodrine hydrochloride;

Annotated entities:
- Condition: "allergies"
- Drug: "midodrine hydrochloride"